關於減重，下列敘述何者錯誤？
A. 飲食控制的重點，在於減少總熱量的攝取
B. 一般而言，在6個月內，減輕原先體重的15 %，是一個很容易達成的目標
C. 對重度肥胖的病人，在內科療法無效時，減重手術（bariatric surgery）是一種合理的選擇
D. Lorcaserin 是作用在中樞神經，為抑制食慾的藥物

正確答案：B. 一般而言，在6個月內，減輕原先體重的15 %，是一個很容易達成的目標